Clinical trial exclusion criterion:
Patients who are hemodynamically unstable even if they have hemoglobin levels> 6g / dL.

Entity relations:
- Has_value("hemoglobin levels", "> 6g / dL")